Clinical trial inclusion criterion:
Subjects with documented physician diagnosis of asthma as their primary respiratory disease.

Annotated entities:
- Condition: "asthma"
- Qualifier: "primary respiratory disease"